Significant pulmonary disease, (e.g., restrictive pulmonary disease, constrictive or COPD) or any other disease or malfunction of the lungs or respiratory system that produces chronic symptoms

The above is a clinical trial exclusion criterion. Annotated with entity spans:
[Qualifier: Significant] [Condition: pulmonary disease], (e.g., [Condition: restrictive pulmonary disease], constrictive or [Condition: COPD]) or [Non-query-able: any other disease or malfunction of the lungs or respiratory system that produces chronic symptoms]